關於氣管狹窄手術的麻醉之敘述，下列何者錯誤？
A. 氣管小於 5 mm 時可能須先行擴張
B. 應先行麻醉再插氣管內管
C. 如有 subglottic stenosis 可能須先行擴張，再插氣管內管
D. 氣管鏡檢查最好開刀中才作

正確答案：B. 應先行麻醉再插氣管內管